Clinical trial exclusion criterion:
Cholecystectomy.

Annotated entities:
- Procedure: "Cholecystectomy"